Clinical trial exclusion criteria:
GCS less than 15
Preoperative Heart Rate less than 50 beat/min
No Beta-Blockers
Pregnant patients
Take any Alpha-Methyldopa, Clonodine, Other Alpha-2 Adrenergic Agonist
Hemodynamic unstable
Systolic BP more than 160mmHg
CAD
Renal insuffuciency
Allergy in dexmedethomidine and opioid
BMI more than 30
Denied consent

Annotated entities:
- Measurement: "GCS"
- Value: "less than 15"
- Measurement: "Preoperative Heart Rate"
- Value: "less than 50 beat/min"
- Negation: "No"
- Drug: "Beta-Blockers"
- Condition: "Pregnant"
- Drug: "Alpha-Methyldopa"
- Drug: "Clonodine"
- Qualifier: "Other"
- Drug: "Alpha-2 Adrenergic Agonist"
- Condition: "Hemodynamic unstable"
- Measurement: "Systolic BP"
- Value: "more than 160mmHg"
- Condition: "CAD"
- Condition: "Renal insuffuciency"
- Condition: "Allergy"
- Drug: "dexmedethomidine"
- Drug: "opioid"
- Measurement: "BMI"
- Value: "more than 30"
- Informed_consent: "Denied consent"